下列關於簡單型熱痙攣（simple febrile seizure）之敘述，何者錯誤？
A. 於一歲以前發作者，易再發
B. 與將來是否智能不足無關
C. 與將來是否有行為異常無關
D. 即使神經理學檢查正常，其死亡率仍較正常人顯	增加

正確答案：D. 即使神經理學檢查正常，其死亡率仍較正常人顯	增加